History of blast and/or impact head trauma mTBI meeting Defense and Veterans Brain Injury Center (DVBIC) mTBI criteria, which define mTBI as an injury to the head causing at least one of the following: alteration in consciousness (for up to 24 hours after the injury), loss of consciousness 0-30 minutes, and/or post-traumatic amnesia up to 1 day post-injury. If available, the Glasgow Coma Scale score must be 13-15, and head imaging findings (if imaging was performed) must be negative.

The above is a clinical trial inclusion criterion. Annotated with entity spans:
[Temporal: History of] [Observation: blast] and/or [Condition: impact head trauma] mTBI [Value: meeting] [Measurement: Defense and Veterans Brain Injury Center (DVBIC) mTBI criteria], which define mTBI as an injury to the head causing at least one of the following: [Condition: alteration in consciousness] ([Temporal: for up to 24 hours after the injury]), [Condition: loss of consciousness] [Temporal: 0-30 minutes], and/or [Condition: post-traumatic amnesia] [Temporal: up to 1 day post-injury]. If available, the [Measurement: Glasgow Coma Scale] score must be [Value: 13-15], and [Procedure: head imaging] [Condition: findings] (if imaging was performed) must be [Negation: negative].